下列何種疾病較不會導致Hydrops of the gallbladder？
A. 川崎氏症（Kawasaki disease）
B. 鏈球菌咽喉炎（Streptococcal pharyngitis）
C. 過敏性紫斑症（Henoch-Schönlein purpura）
D. 囊狀纖維化（Cystic fibrosis）

正確答案：D. 囊狀纖維化（Cystic fibrosis）